基底核（basal ganglia）的直接迴路（direct pathway）不經過下列何構造？
A. 丘腦（thalamus）
B. 丘腦下核（subthalamus）
C. 大腦皮質運動區（motor cortex）
D. 蒼白球（globus pallidus）

正確答案：B. 丘腦下核（subthalamus）